ASA IV

The above is a clinical trial exclusion criterion. Annotated with entity spans:
[Measurement: ASA] [Value: IV]